Selected for neuraxial anesthesia rather than general anesthesia for the open reduction surgery

The above is a clinical trial exclusion criterion. Annotated with entity spans:
Selected for [Procedure: neuraxial anesthesia] [Negation: rather than] [Procedure: general anesthesia] for the [Procedure: open reduction surgery]